Todas las afirmaciones siguientes que describen a las endonucleasas de restricción son ciertas EXCEPTO:
1. No proporcionan extremos de cadena única en las piezas complementarias de DNA.
2. Están limitadas por la metilación de las secuencias de reconocimiento.
3. Reconocen secuencias palidrómicas.
4. Rompen ambas cadenas en el DNA dúplex.
5. Son específicas de secuencias simétricas cortas.

Respuesta correcta: 1. No proporcionan extremos de cadena única en las piezas complementarias de DNA.